Clinical trial exclusion criterion:
Past medical history of dysphagia or aspiration pneumonia

Annotated entities:
- Condition: "dysphagia"
- Temporal: "Past medical history"
- Condition: "aspiration pneumonia"